一位13 歲女孩，因臉色較為蒼白到門診求診。血液檢查WBC：6,100/mm3、Hb：7.0 g/dL、MCV：60 fL、血小板：220,000/mm3、ferritin 4 ng/mL，醫師問診得知女孩每次月經血量較多，後續實驗室檢查發現 bleeding time延長、activated partial thromboplastin time（aPTT）：72.3/29.6（patient/control）秒，該女孩最可能有下列那一項疾病？
A. 血友病（hemophilia）
B. 第七凝血因子缺乏症
C. von Willebrand 病
D. Protein C 缺乏

正確答案：C. von Willebrand 病